Clinical trial exclusion criterion:
Evidence of oral distant metastasis or other malignancies

Entity relations:
- Has_qualifier("malignancies", "other")
- Has_qualifier("metastasis", "distant")
- Has_qualifier("metastasis", "oral")
- OR("metastasis", "malignancies")